75歲的張先生因為記憶力及認路能力日漸惡化，經過神經科專科醫師診斷，得了阿茲海默症（Alzheimer  disease），依照臨床嚴重度量表（CDR） 的分級為1.0。這幾天，張先生看到太太與送報的人聊上幾句就大發脾氣，也不准張太太接電話，這可能是何種症狀？
A. delusion of persecution
B. delusion of stealing（theft）
C. delusion of jealousy
D. delusion of not my home

正確答案：C. delusion of jealousy